Clinical trial inclusion criterion:
Eligibility to immediate-release MPH (IR-MPH) treatment

Entity relations:
- Has_mood("immediate-release MPH (IR-MPH)", "Eligibility")